¿Cuántas moléculas de ADN contiene una célula diploide 2n=46 durante la fase G2?:
1. 92.
2. 23.
3. 46.
4. 44.
5. 21.

Respuesta correcta: 1. 92.